2. Male, 35-80 years; female, postmenopausal to 80 years;

The above is a clinical trial inclusion criterion. Annotated with entity spans:
2. [Person: Male], [Person: 35-80 years]; [Person: female], [Condition: postmenopausal] [Person: to 80 years];